Clinical trial inclusion criterion:
American Society of Anesthesiology (ASA) physical status class 1-3

Entity relations:
- Subsumes("American Society of Anesthesiology physical status class", "ASA")
- Has_value("American Society of Anesthesiology physical status class", "1-3")